Clinical trial inclusion criterion:
3. The subject will have been on insulin pump therapy for at least 3 months and currently using a fast actin insulin analog (Lispro, Aspart or Guilisine).

Annotated entities:
- Parsing_Error: "3."
- Procedure: "insulin pump therapy"
- Temporal: "for at least 3 months"
- Temporal: "currently"
- Drug: "fast actin insulin analog"
- Drug: "Lispro"
- Drug: "Aspart"
- Drug: "Guilisine"